El esqueleto carbonado de la cisteína se convierte durante su catabolismo, total o parcialmente, en:
1. Acetil-CoA.
2. Acetoacetil-CoA.
3. -Cetoglutarato.
4. Piruvato.

Respuesta correcta: 4. Piruvato.